Clinical trial inclusion criterion:
Able to provide informed consent

Annotated entities:
- Informed_consent: "Able to provide informed consent"